兒童時期發生的系統性紅斑性狼瘡（systemic lupus erythematosus, SLE），預後比成人時期才發作的系統性紅斑性狼瘡的預後差，主要是兒童的那個器官系統較易受影響？
A. 心臟
B. 中樞神經系統
C. 腎臟
D. 血液

正確答案：C. 腎臟